Clinical trial exclusion criterion:
Serious, uncontrolled disease (including serious psychological disorders) likely to interfere with the study or impact on subject safety.

Entity relations:
- Subsumes("uncontrolled disease", "psychological disorders")